History of head injury or stroke

The above is a clinical trial exclusion criterion. Annotated with entity spans:
[Temporal: History] of [Condition: head injury] or [Condition: stroke]